Clinical trial exclusion criterion:
Any major illness (Liver disease, Renal failure, Heart disease, Cancer, etc)

Entity relations:
- Subsumes("major illness", "Liver disease")
- OR("Liver disease", "Heart disease", "Renal failure", "Cancer")